Clinical trial exclusion criterion:
Contraindications to hormonal contraceptive use per package insert, including history of deep vein thrombosis, smoking in women older than 35 years

Annotated entities:
- Procedure: "hormonal contraceptive"
- Observation: "Contraindications to hormonal contraceptive"
- Condition: "deep vein thrombosis"
- Person: "women"
- Observation: "smoking"
- Value: "older than 35 years"